Clinical trial exclusion criterion:
Currently prescribed a phosphodiesterase (PDE) inhibitors medication (ex: Viagra, Cialis, etc)

Annotated entities:
- Drug: "phosphodiesterase (PDE) inhibitors"
- Drug: "Viagra"
- Drug: "Cialis"